History of reaction to study antibiotics,

The above is a clinical trial exclusion criterion. Annotated with entity spans:
[Temporal: History] of [Condition: reaction] to [Drug: study antibiotics],